Use of oral or intravaginal antibiotics within the past 2 weeks

The above is a clinical trial exclusion criterion. Annotated with entity spans:
Use of [Drug: oral] or [Drug: intravaginal antibiotics] [Temporal: within the past 2 weeks]